Clinical trial exclusion criterion:
Total lesion area of >12 DA or >30.5 mm2

Entity relations:
- Has_value("Total lesion area", ">12 DA")
- OR(">12 DA", ">30.5 mm2")